1. Decrease in size of the designated target ulcer(s) by ≥ 30% during the 7-day screening period

The above is a clinical trial exclusion criterion. Annotated with entity spans:
[Parsing_Error: 1.] [Qualifier: Decrease in size] of the designated [Condition: target ulcer](s) by [Value: ≥ 30%] [Temporal: during the 7-day screening period]